Allergic reactions against fish or egg proteins

The above is a clinical trial exclusion criterion. Annotated with entity spans:
[Condition: Allergic reactions] against [Drug: fish] or [Drug: egg proteins]